Clinical trial exclusion criterion:
Have a contraindication to NRT with no medical clearance from the primary care provider or study physician

Annotated entities:
- Condition: "contraindication"
- Procedure: "NRT"